Clinical trial inclusion criterion:
Group I PAH, defined as a mPAP=25mmHg, PCWP<15mmHg and PVR[The PVR =(mPAP-PCWP)/CO]>3.0 Woods unit.

Annotated entities:
- Qualifier: "Group I"
- Condition: "PAH"
- Measurement: "mPAP"
- Value: "=25mmHg"
- Measurement: "PCWP"
- Value: "<15mmHg"
- Measurement: "PVR"
- Measurement: "(mPAP-PCWP)/CO"
- Value: ">3.0 Woods unit"